Clinical trial exclusion criterion:
Bare-metal stent implantation within 1 month prior to TAVI procedure;

Entity relations:
- multi("TAVI procedure", "TAVI procedure")
- AND("within 1 month prior to TAVI procedure", "TAVI procedure")
- AND("implantation", "Bare-metal stent")
- Has_temporal("implantation", "within 1 month prior to TAVI procedure")
- Has_index("within 1 month prior to TAVI procedure", "TAVI procedure")